下列有關 MHC（major histocompatibility complex）的敘述，何者錯誤？
A. MHC 位於人類的第六對染色體（chromosome 6）
B. MHC 的表現依 human leukocyte antigen（HLA）的不同，可分為 class I 與 class II 兩類，而 HLA-DQ 屬於 class I
C. MHC class I 的表現需 cytotoxic CD8 T cell 的幫忙
D. 在器官移植時，MHC 與 T cell-mediated 的 rejection 有關

正確答案：B. MHC 的表現依 human leukocyte antigen（HLA）的不同，可分為 class I 與 class II 兩類，而 HLA-DQ 屬於 class I